Inability to provide an informed consent

The above is a clinical trial exclusion criterion. Annotated with entity spans:
[Non-query-able: Inability to provide an informed consent]